Clinical trial exclusion criteria:
Previous or concurrent hormonal management of prostate cancer
Contraindication for prescription of Firmagon®
Concurrent treatment with a 5-a-reductase inhibitor
Considered as a candidate for curative therapy
History of severe untreated asthma, anaphylactic reactions or severe urticaria and/or angioedema
QTc interval over 450 msec or risk factors for torsades de pointes or on Class IA and Class III anti arrhythmic medications
Cancer within the last 5 years except prostate cancer and surgically removed basal or squamous cell carcinoma of the skin
Known or suspected hepatic, symptomatic biliary disease (this includes moderate to severe chronic hepatic impairment)
Patients with clinically significant laboratory abnormalities / disorders other than prostate cancer
Patient with Hepatitis B Virus (HBV), Hepatitis C Virus (HCV) and Human Immunodeficiency Virus (HIV) infections

Annotated entities:
- Procedure: "hormonal management"
- Condition: "prostate cancer"
- Condition: "Contraindication"
- Drug: "Firmagon"
- Drug: "5-a-reductase inhibitor"
- Procedure: "curative therapy"
- Condition: "asthma"
- Qualifier: "untreated"
- Qualifier: "severe"
- Condition: "anaphylactic reactions"
- Condition: "urticaria"
- Qualifier: "severe"
- Condition: "angioedema"
- Measurement: "QTc interval"
- Value: "over 450 msec"
- Observation: "risk factors for torsades de pointes"
- Drug: "Class III anti arrhythmic medications"
- Drug: "Class IA anti arrhythmic medications"
- Condition: "Cancer"
- Temporal: "last 5 years"
- Negation: "except"
- Condition: "prostate cancer"
- Condition: "squamous cell carcinoma of the skin"
- Condition: "basal cell carcinoma of the skin"
- Procedure: "surgically"
- Condition: "biliary disease"
- Condition: "hepatic disease"
- Qualifier: "moderate"
- Qualifier: "severe"
- Condition: "chronic hepatic impairment"
- Non-query-able: "Patients with clinically significant laboratory abnormalities / disorders other than prostate cancer"
- Condition: "Hepatitis B Virus infections"
- Condition: "Hepatitis C Virus infections"
- Condition: "HBV"
- Condition: "HCV"
- Condition: "Human Immunodeficiency Virus infections"
- Condition: "HIV"